Clinical trial inclusion criterion:
In line with clinical stage I / II stage (T1-2 N0 M0; AJCC 2010) and receiving surgical resection

Annotated entities:
- Procedure: "surgical resection"
- Condition: "clinical stage I"
- Condition: "clinical stage II"
- Measurement: "T"
- Value: "1-2"
- Measurement: "N"
- Value: "0"
- Measurement: "M"
- Value: "0"